Clinical trial exclusion criterion:
History or other evidence of severe retinopathy (e.g. CMV retinitis, macula degeneration) or clinically relevant ophthalmological disorder due to diabetes mellitus or hypertension

Entity relations:
- Has_qualifier("retinopathy", "severe")
- Subsumes("retinopathy", "CMV retinitis")
- AND("ophthalmological disorder", "diabetes mellitus")
- OR("CMV retinitis", "macula degeneration")
- OR("diabetes mellitus", "hypertension")
- OR("retinopathy", "clinically relevant", "ophthalmological disorder")